Clinical trial inclusion criterion:
Aged over 18

Annotated entities:
- Person: "Aged"
- Value: "over 18"